Clinical trial exclusion criterion:
7. Have an ALT/AST>3x upper limit of normal.

Annotated entities:
- Measurement: "ALT/AST"
- Value: ">3x upper limit of normal"